下列何者不是經尿道前列腺切除症候群（transurethral resection of prostate syndrome）的典型症狀？
A. 視覺模糊
B. 高血壓
C. 嘔吐
D. 心跳加速

正確答案：D. 心跳加速